Women above 18 years of age with biopsy proven, clinically stage 1 or 2 breast cancer who will be undergoing partial mastectomy with SLNBx at Memorial Health

The above is a clinical trial inclusion criterion. Annotated with entity spans:
[Person: Women] [Value: above 18 years] of [Person: age] with [Procedure: biopsy] proven, clinically [Qualifier: stage 1] or 2 [Condition: breast cancer] who [Mood: will be undergoing] [Procedure: partial mastectomy] with [Procedure: SLNBx] [Visit: at Memorial Health]